Have had >4 emergency department visits within 12 months for 2 consecutive 12-month periods. Period of time can be extended by up to 6 months if incarcerated or institutionalized for ≥ 6 months.

The above is a clinical trial inclusion criterion. Annotated with entity spans:
Have had [Multiplier: >4] [Visit: emergency department visits] [Temporal: within 12 months] for [Multiplier: 2 consecutive] [Temporal: 12-month periods]. Period of time can be [Temporal: extended by up to 6 months] if [Person: incarcerated] or [Person: institutionalized] for ≥ 6 months.